Abnormal complete blood count. Any of the following:

The above is a clinical trial exclusion criterion. Annotated with entity spans:
[Condition: Abnormal complete blood count]. [Parsing_Error: Any of the following:]